Clinical trial exclusion criteria:
Age less than 14 years
Pregnancy
Estimated life expectancy (due to comorbidities) less than 90 days
Presence of relative or absolute contraindications to CPFA
Admission from an other ICU where the patient remained for more than 24 hours
Absence of informed consent

Annotated entities:
- Person: "Age"
- Value: "less than 14 years"
- Condition: "Pregnancy"
- Person: "Estimated life expectancy"
- Value: "less than 90 days"
- Condition: "relative contraindications"
- Condition: "absolute contraindications"
- Procedure: "CPFA"
- Procedure: "Admission"
- Visit: "an other ICU"
- Observation: "patient remained"
- Multiplier: "for more than 24 hours"
- Informed_consent: "Absence of informed consent"